Please list 2 human diseases caused by a coronavirus.

Middle East respiratory syndrome (MERS) and SARS are diseases caused by a coronavirus.